Clinical trial inclusion criterion:
Meets IR criteria and M3 marrow on day 15 (not SR and M3 on day 15)

Entity relations:
- Has_value("IR criteria", "Meets")
- Has_temporal("M3 marrow", "on day 15")
- Has_value("SR", "not")
- Has_temporal("M3", "on day 15")